Clinical trial exclusion criterion:
malignant neoplasm of any location

Annotated entities:
- Qualifier: "malignant"
- Condition: "neoplasm"